Clinical trial exclusion criterion:
Participation in another clinical trial within the 30 days prior to randomization.

Annotated entities:
- Non-query-able: "Participation in another clinical trial within the 30 days prior to randomization."